Clinical trial exclusion criterion:
Substance or alcohol abuse.

Annotated entities:
- Condition: "alcohol abuse"
- Condition: "Substance abuse"